Patients affected by inflammatory bowel disease

The above is a clinical trial exclusion criterion. Annotated with entity spans:
Patients affected by [Condition: inflammatory bowel disease]